Clinical trial exclusion criterion:
Epileptiform EEG

Annotated entities:
- Measurement: "EEG"
- Value: "Epileptiform"